Clinical trial exclusion criterion:
Previous surgical management of ovarian pathology

Entity relations:
- AND("surgical management", "ovarian pathology")
- Has_temporal("surgical management", "Previous")